Target lesion located in the left main stem

The above is a clinical trial exclusion criterion. Annotated with entity spans:
[Condition: Target lesion] located in the [Qualifier: left main stem]